下列有關肥厚性心肌病變（hypertrophic cardiomyopathy）的敍述，何者錯誤？
A. 有一半的病人可能有家族史及基因變異
B. 聽診時常出現第四心音（S4）
C. 最常見的死因為猝死（sudden cardiac death）
D. 若病人臨床上出現氣促（dyspnea）及胸痛（chest pain），則以利尿劑（diuretics）及硝酸鹽（nitrate）為首選藥物

正確答案：D. 若病人臨床上出現氣促（dyspnea）及胸痛（chest pain），則以利尿劑（diuretics）及硝酸鹽（nitrate）為首選藥物